女童突發四肢無力至急診。血壓100/60 mmHg，血液檢查發現：肌酸酐0.6 mg/dL，鈉離子濃度136  mmol/L，鉀離子濃度2.2 mmol/L，滲透壓293 mOsmol/kgH2O。尿液檢查發現：肌酸酐98.5 mg/dL，鈉離子濃度30 mmol/L，鉀離子濃度37 mmol/L，滲透壓370 mOsmol/kgH2O，女童Trans-tubular potassium gradient（TTKG）數值為何？
A. 0.075
B. 13.3
C. 9.76
D. 0.1024

正確答案：B. 13.3